Clinical trial inclusion criterion:
Absence of any sign of dementia/cognitive impairment in neuropsychological examinationsPatients for brain imaging:

Entity relations:
- multi("sign of dementia", "dementia")
- multi("sign of cognitive impairment", "cognitive impairment")
- causal("sign of dementia", "neuropsychological examinations")
- Has_negation("sign of dementia", "Absence of")
- OR("sign of dementia", "sign of cognitive impairment")